一位 55 歲慢性精神分裂症殘餘型（residual type）患者，住在精神科日間病房，規則接受藥物及職能復健治療，已有兩個月。此患者較不可能出現下列何種症狀？
A. 思考中斷（thought blocking）
B. 缺乏動機（lack of motivation）
C. 社交退縮（social withdrawal）
D. 攻擊行為（aggressive behavior）

正確答案：D. 攻擊行為（aggressive behavior）